Clinical trial inclusion criterion:
bariatric surgery patients

Annotated entities:
- Procedure: "bariatric surgery"